Para detectar cantidades sumamente pequeñas de peróxido de hidrógeno en el agua sirve una mezcla de cloruro de hierro (III) y hexacianoferrato (III) de potasio (ferricianuro potásico). La presencia de H2O2 origina, tras un corto tiempo, un intenso color azul oscuro. Ello se debe a que el peróxido de hidrógeno:
1. Reduce el hexacianoferrato (III) a hexacianoferrato (II).
2. Oxida al hexacianoferrato (III).
3. Oxida al cloruro de hierro (III).
4. Forma peroxo-ciano complejos de Fe (III).
5. Oxida a los cianocomplejos hasta cianato complejos.

Respuesta correcta: 1. Reduce el hexacianoferrato (III) a hexacianoferrato (II).